What is the drug target for Simtuzumab?

Simtuzumab is a humanized monoclonal antibody drug that targets LOXL2